a history of arrhythmia, bronchial and cardiovascular diseases, abnormal liver function and so on

The above is a clinical trial exclusion criterion. Annotated with entity spans:
a [Temporal: history] of [Condition: arrhythmia], [Condition: bronchial] and [Condition: cardiovascular diseases], [Condition: abnormal liver function] and so on